Clinical trial exclusion criterion:
Use of steroids or drugs that interfere with the metabolism of estrogen.

Entity relations:
- OR("steroids", "drugs that interfere with the metabolism of estrogen")